下列何者不是造成老年人夜尿症（nocturia）的原因？
A. 睡眠呼吸中止症候群（sleep apnea syndrome）
B. 逼尿肌活性過強
C. 前列腺肥大症併膀胱出口阻塞
D. 應力性尿失禁（stress urinary incontinence）

正確答案：D. 應力性尿失禁（stress urinary incontinence）